Clinical trial inclusion criterion:
Presence of chronic HCV infection based on chart review will be defined as positive for anti-HCV antibody or HCV RNA at least 6 months before screening.

Entity relations:
- Has_temporal("HCV infection", "chronic")
- Has_value("anti-HCV antibody", "positive")
- Has_temporal("anti-HCV antibody", "at least 6 months before screening")
- AND("HCV infection", "anti-HCV antibody")
- OR("anti-HCV antibody", "HCV RNA")